魏小弟今年 12 歲，幾年來逐漸肌肉萎縮無力，以肢體近端之肌肉最為嚴重，自己無法從蹲姿站起來。全身的肌肉都有萎縮，但是腓腸肌則有肥大現象。魏小弟的 16 歲哥哥已經以輪椅代步，但 18 歲的姊姊與父母親都外觀正常。聽說有一位阿姨的兒子也得到同樣的疾病，另外有一位舅舅在 19 歲時因呼吸衰竭而過世。魏小弟最有可能罹患下列那一種疾病？
A. 第一型遺傳性運動及感覺神經病變（hereditary motor and sensory neuropathy, type I）
B. 亨丁頓氏症（Huntington's disease）
C. 裘馨氏肌肉失養症（Duchenne muscular dystrophy）
D. 強直性肌肉失養症（myotonic dystrophy）

正確答案：C. 裘馨氏肌肉失養症（Duchenne muscular dystrophy）